La piruvato carboxilasa:
1. Requiere biotina.
2. Usa un grupo metilo activado como fuente de carbono.
3. Cataliza la producción de acetil-CoA y dióxido de carbono.
4. Se activa en el músculo durante el ciclo de Cori.
5. Es un intermediario del ciclo del ácido cítrico.

Respuesta correcta: 1. Requiere biotina.